Clinical trial exclusion criterion:
Female participants who are breastfeeding or pregnant at Screening or Baseline (as documented by a positive beta-human chorionic gonadotropin test). A separate Baseline assessment is required if a negative screening pregnancy test was obtained more than 72 hours before the first dose of study drug.

Entity relations:
- Has_temporal("breastfeeding", "at Screening")
- Has_value("beta-human chorionic gonadotropin test", "positive")
- Has_value("screening pregnancy test", "negative")
- Has_qualifier("Baseline assessment", "separate")
- Has_index("more than 72 hours before the first dose of study drug", "the first dose of study drug")
- Has_temporal("screening pregnancy test", "more than 72 hours before the first dose of study drug")
- AND("screening pregnancy test", "Baseline assessment")
- AND("beta-human chorionic gonadotropin test", "screening pregnancy test")
- OR("at Screening", "at Baseline")
- OR("breastfeeding", "pregnant")